History of cancer in the preceding 2 years other than successfully treated, non-metastatic, squamous cell or basal cell carcinoma, or cervical cancer in situ.

The above is a clinical trial exclusion criterion. Annotated with entity spans:
History of [Condition: cancer] in the [Temporal: preceding 2 years] [Negation: other] than [Qualifier: successfully treated], [Qualifier: non-metastatic], squamous cell or [Condition: basal cell carcinoma], or [Condition: cervical cancer in situ].